lack of ability to use the study devices

The above is a clinical trial exclusion criterion. Annotated with entity spans:
[Negation: lack of] [Observation: ability to use the study devices]